下列那一種 X 光檢查最適用於檢測蝶竇是否有問題？
A. Waters view
B. Caldwell view
C. Skull lateral view
D. Submental vertical view

正確答案：C. Skull lateral view